Willingness and ability to comply with scheduled visits, treatment plans and any other study procedures

The above is a clinical trial inclusion criterion. Annotated with entity spans:
[Post-eligibility: Willingness and ability to comply with scheduled visits, treatment plans and any other study procedures]